Clinical trial exclusion criterion:
Latent tuberculosis unless effective anti-tuberculosis therapy has been completed, or active tuberculosis.

Entity relations:
- Has_negation("completed", "unless")
- Has_qualifier("anti-tuberculosis therapy", "completed")
- AND("Latent tuberculosis", "anti-tuberculosis therapy")
- OR("Latent tuberculosis", "active tuberculosis")